Clinical trial inclusion criterion:
SCI above L5

Entity relations:
- Has_value("SCI", "above L5")